Clinical trial exclusion criterion:
11. Eltrombopag

Annotated entities:
- Parsing_Error: "11."
- Drug: "Eltrombopag"